李先生今年 65 歲，1 年前記憶力明顯減退，走路不穩，晚上常常跌倒。身體診查發現李先生兩腳無力，下肢肌腱反射下降，出現 Babinski sign；雙腳的本體感覺及對音叉的震動感消失，但針刺感則正常。李先生家中並沒有其他成員有和他一樣的症狀，也沒有接觸任何化學溶劑，未曾服用中藥， 年前曾接受全胃切除手術。下列那一項檢查對診斷最有幫助？
A. 腦電圖檢查（EEG）
B. 血中維他命 B12濃度檢查
C. 腦部造影檢查（CT 或 MRI）
D. 腦脊髓液檢查

正確答案：B. 血中維他命 B12濃度檢查